Clinical trial inclusion criterion:
ECOG=1 or if ECOG=2 but recover after pretreatment.

Entity relations:
- Has_value("ECOG", "=1")
- Has_index("after pretreatment", "pretreatment")
- Has_value("ECOG", "=2")
- AND("ECOG", "recover")
- Has_temporal("recover", "after pretreatment")
- multi("pretreatment", "pretreatment")
- OR("ECOG", "ECOG")